Clinical trial exclusion criterion:
2. Unavailability of brain MRI (in case of absolute contraindications, the use of cranial CT is allowed).

Annotated entities:
- Parsing_Error: "2."
- Procedure: "brain MRI"
- Negation: "Unavailability"
- Observation: "Unavailability"
- Non-query-able: "Unavailability"
- Procedure: "cranial CT"
- Condition: "absolute contraindications"
- Undefined_semantics: "absolute contraindications"